Clinical trial inclusion criterion:
FRC > 120 % predicted

Entity relations:
- Has_value("FRC", "> 120 % predicted")